Clinical trial inclusion criterion:
= 50 years old.

Entity relations:
- Has_value("old", "= 50 years")